women previously diagnosed with localized vestibulodynia,

The above is a clinical trial inclusion criterion. Annotated with entity spans:
[Person: women] previously diagnosed with [Condition: localized vestibulodynia],